adequately controlled with appropriate therapy or would compromise the patient's ability to tolerate this therapy; 2. Treatment with any systemic anticancer therapy ≤ 3 weeks prior to cycle 1 day 1 3. Uncontrolled active infection (Hepatitis B and C infection are NOT exclusion criteria) and/or known HIV infection; 4. Renal failure requiring haemodialysis or peritoneal dialysis; 5. Patients who are pregnant or breast-feeding; 6. Patients with significantly diseased or obstructed gastrointestinal tract, malabsorption, uncontrolled vomiting or diarrhea resulting in inability to swallow oral medications; 7. Presence of symptomatic CNS metastasis 8. Unresolved toxicity from previous anti-cancer therapy or incomplete recovery from surgery, in particular oxaliplatin-induced peripheral neuropathy > grade 1.

The above is a clinical trial exclusion criterion. Annotated with entity spans:
[Subjective_judgement: adequately controlled with appropriate therapy or would compromise the patient's ability to tolerate this therapy; 2.] Treatment with any [Procedure: systemic anticancer therapy] [Temporal: ≤ 3 weeks prior to cycle 1] day 1 3. [Qualifier: Uncontrolled] [Temporal: active] [Condition: infection] ([Condition: Hepatitis B] and C infection are [Negation: NOT] exclusion criteria) and/or known [Condition: HIV infection]; 4. [Condition: Renal failure] requiring [Procedure: haemodialysis] or [Procedure: peritoneal dialysis]; [Parsing_Error: 5.] Patients who are [Condition: pregnant] or [Condition: breast-feeding]; [Parsing_Error: 6.] Patients with [Qualifier: significantly] [Condition: diseased] or [Condition: obstructed gastrointestinal tract], [Condition: malabsorption], [Qualifier: uncontrolled] [Condition: vomiting] or [Condition: diarrhea] resulting in [Condition: inability to swallow oral medications]; [Parsing_Error: 7.] Presence of [Qualifier: symptomatic] [Condition: CNS metastasis] [Parsing_Error: 8.] [Condition: Unresolved toxicity] from [Temporal: previous] [Procedure: anti-cancer therapy] or [Condition: incomplete recovery] from [Procedure: surgery], in particular [Qualifier: oxaliplatin-induced] [Condition: peripheral neuropathy] > grade 1.